Clinical trial inclusion criteria:
Patients presenting with ST-elevation acute myocardial infarction (STEMI) within 12 hours of their symptom onset in whom TIMI-3 flow was established in infarct related artery (IRA) after balloon angioplasty or thrombectomy.

Annotated entities:
- Condition: "ST-elevation acute myocardial infarction (STEMI)"
- Temporal: "within 12 hours of their symptom onset"
- Reference_point: "their symptom onset"
- Observation: "TIMI-3 flow was established"
- Qualifier: "infarct related artery (IRA)"
- Temporal: "after balloon angioplasty or thrombectomy"
- Procedure: "balloon angioplasty"
- Procedure: "thrombectomy"
- Reference_point: "balloon angioplasty or thrombectomy"